下列何者是骨盆橫膈（pelvic diaphragm）的一部分？
A. 提肛肌（levator ani）
B. 閉孔內肌（obturator internus）
C. 會陰深橫肌（deep transverse perineal muscle）
D. 尿道外括約肌（external urethral sphincter）

正確答案：A. 提肛肌（levator ani）